下列何者不會參與眼睛之調節（accommodation）功能？
A. 水晶體（lens）
B. 小帶纖維（zonular fiber）
C. 睫狀肌（ciliary muscle）
D. 角膜曲度（corneal curvature）

正確答案：D. 角膜曲度（corneal curvature）